Clinical trial inclusion criterion:
PSA = 20 ng/ml

Entity relations:
- Has_value("PSA", "= 20 ng/ml")